52 歲女性病患，住在鄉下務農，主訴最近三個月來發現走路時左腳會掉拖鞋，騎腳踏車巡田時由左側停車時偶而會摔倒；神經科檢查發現下肢肌力右側 5，左側 4；Knee 及 Ankle DTR（Deep tendon reflex）：右側（++）、左側（+++），下列何項診斷較為可能？
A. 下背部肌膜炎（low back myofacial pain）
B. 腰椎滑脫（lumbar spondylolisthesis）
C. 右大腦矢狀竇旁腫瘤（right parasagittal tumor）
D. 腰椎間盤突出（lumbar HIVD）

正確答案：C. 右大腦矢狀竇旁腫瘤（right parasagittal tumor）